所有生物細胞膜內的脂雙層具有下列何種共同特色？
A. 個別的油脂分子能在脂雙層的表面自由地側向擴散（lateral diffusion）
B. 個別的油脂分子能夠快速在脂雙層中的其中一層自由翻轉擴散（flip-flop diffusion）至另外一層
C. 具有極性但不帶電荷之化合物容易經由擴散穿過脂雙層
D. 脂雙層利用鄰近磷脂分子之間的共價鍵而形成穩定結構

正確答案：A. 個別的油脂分子能在脂雙層的表面自由地側向擴散（lateral diffusion）